Temperature 35-37.9°C (95-100.3°F)

The above is a clinical trial inclusion criterion. Annotated with entity spans:
[Measurement: Temperature] [Value: 35-37.9°C] ([Value: 95-100.3°F])